Clinical trial exclusion criterion:
Historical or current evidence of clinically significant or rapidly progressing or unstable cardiovascular, neurological, cardiovascular, neurological, renal, hepatic, immunological, endocrine (including uncontrolled diabetes or thyroid disease) or hematological abnormalities that are uncontrolled. Significant is defined as any disease that, in the opinion of the investigator, would put the safety of the subject at risk through participation, or which would affect the analysis if the disease/condition exacerbated during the study.

Annotated entities:
- Condition: "hematological abnormalities"
- Qualifier: "clinically significant"
- Qualifier: "rapidly progressing"
- Condition: "cardiovascular abnormalities"
- Qualifier: "unstable"
- Condition: "neurological abnormalities"
- Condition: "cardiovascular abnormalities"
- Condition: "neurological abnormalities"
- Condition: "renal abnormalities"
- Condition: "hepatic abnormalities"
- Condition: "immunological abnormalities"
- Condition: "endocrine abnormalities"
- Qualifier: "uncontrolled"
- Condition: "diabetes"
- Condition: "thyroid disease"
- Qualifier: "uncontrolled"
- Observation: "Historical"
- Temporal: "current"
- Non-representable: "Significant is defined as any disease that, in the opinion of the investigator, would put the safety of the subject at risk through participation, or which would affect the analysis if the disease/condition exacerbated during the study."